2. diagnosis of moderate to severe AT, confirmed by Dr. Wilson using clinical symptoms and exam findings consistent with chronic AT (>6 month duration) - which includes pain while palpating the intratendinous swelling part of the Achilles tendon and relief of pain when tendon placed under tension - and pre-procedure US

The above is a clinical trial inclusion criterion. Annotated with entity spans:
2. diagnosis of [Qualifier: moderate to severe] [Condition: AT], [Non-query-able: confirmed by Dr. Wilson] using clinical symptoms and exam findings consistent with [Condition: chronic AT] ([Temporal: >6 month duration]) - which includes [Condition: pain while palpating the intratendinous swelling part of the Achilles tendon] and [Condition: relief of pain when tendon placed under tension] - and pre-procedure US